fetus in cephalic presentation

The above is a clinical trial inclusion criterion. Annotated with entity spans:
fetus in [Condition: cephalic presentatio]n